En las reacciones de hipersensibilidad mediada por IgE:
1. Juegan un papel importante los eosinófilos y los mastocitos.
2. No intervienen elementos celulares.
3. Juegan un papel fundamental las reacciones de citotoxicidad mediadas por anticuerpos.
4. No intervienen elementos del sistema inmune implicados en la atopia.
5. No     interviene   el   receptor    de    la inmunoglobulina IgE.

Respuesta correcta: 1. Juegan un papel importante los eosinófilos y los mastocitos.